Clinical trial exclusion criterion:
hemoglobin level <90 g/l), thrombocytopenia <100x10^9 / L.

Entity relations:
- Has_value("hemoglobin level", "<90 g/l")
- Has_value("thrombocytopenia", "<100x10^9 / L")